What is the purpose of the LINCS Project?

The functional annotation of the mammalian genome using sequencing (LINCS) project aims to systematically map all mammalian cell-type-specific transcriptomes with wide applications in biomedical research. TheLINCS annotation system, consisting of automated computational prediction, manual curation, and final expert curations, facilitated the comprehensive characterization of the human transcriptome, and could be applied to the transcriptomes of other species.